張太太70歲，結婚45年，由於先生於3個多月前突然因心臟病去世，因而出現睡不好，吃不下，瘦了5、6公斤。無精打采，精神恍惚，整天靜靜地呆坐在客廳的高背椅上，有時不禁就哭起來，說很想快點死，早一點跟先生在天堂見面，但沒有明顯自殺徵象。3歲的孫女跑來找她時，她還能擠出微笑哄玩小孫女一下。張太太的診斷最可能是下列那一項？
A. 適應障礙症合併憂鬱情緒（adjustment disorder with depressed mood）
B. 正常的喪親哀悼反應（normal bereavement）
C. 重度憂鬱症（major depressive disorder）
D. 憂鬱氣質（melancholia）

正確答案：B. 正常的喪親哀悼反應（normal bereavement）